Clinical trial inclusion criterion:
Living in the Waya Clinic Catchment Area

Entity relations:
- AND("Living", "Waya Clinic Catchment Area")